Clinical trial inclusion criterion:
Age 22 or above

Annotated entities:
- Person: "Age"
- Value: "22 or above"